第十七型輔助性T細胞（TH17）需要何種細胞激素的持續存在，才能夠維持其功能？
A. IL-12
B. IL-23
C. IL-10
D. IFN-γ

正確答案：B. IL-23